泳者癢（swimmer's itch）是由何種寄生蟲導致？
A. 鳥類的血吸蟲（avian Schistosoma spp.）
B. 犬鉤蟲（Ancylostoma caninum）
C. 曼森裂頭絛蟲（Spirometra mansonoides）
D. 蟠尾絲蟲（Onchocerca volvulus）

正確答案：A. 鳥類的血吸蟲（avian Schistosoma spp.）